Subjects taking fish oil or any other supplements, which in the investigator s opinion may interfere with the study.

The above is a clinical trial exclusion criterion. Annotated with entity spans:
[Subjective_judgement: Subjects taking fish oil or any other supplements, which in the investigator s opinion may interfere with the study.]